Drug abuser.

The above is a clinical trial exclusion criterion. Annotated with entity spans:
[Condition: Drug abuser].